Beta-adrenergic blocking agents眼藥水如0.5% Timolol maleate，可抑制房水的產生，為降低眼壓之藥物，但病人有下列何種疾病時絕對不能使用（major contraindication）？
A. 腦中風（stroke）
B. 氣喘（asthma）
C. 高血壓（hypertension）
D. 糖尿病（diabetes mellitus）

正確答案：B. 氣喘（asthma）